Clinical trial exclusion criterion:
Unable to self-care or mental disease without caregiver.

Annotated entities:
- Condition: "Unable to self-care"
- Condition: "mental disease"
- Qualifier: "without caregiver"